Clinical trial inclusion criterion:
Patient able to give verbal and written consent for both cesarean birth and study

Annotated entities:
- Informed_consent: "Patient able to give verbal and written consent for both cesarean birth and study"